下列何種精神疾患與自殺的關聯性最高？
A. 精神分裂症
B. 失智症
C. 情感性疾患
D. 強迫症

正確答案：C. 情感性疾患